Which was the first mutant IDH2 inhibitor to be approved for patients with acute myeloid leukemia?

Enasidenib was the first mutant IDH2 inhibitor to be approved for the treatment of refractory and relapsed acute myeloid leukemia.